一位 50 歲女性，因發燒及右上腹部疼痛來診，腹部理學檢查發現 Murphy's sign 陽性，接下來最適當的檢查為下列何項？
A. 腹部 X 光（KUB）
B. 腹部超音波（ultrasonography）
C. 膽囊攝影（oral cholecystography）
D. 上胃腸道內視鏡檢查（UGI endoscopy）

正確答案：B. 腹部超音波（ultrasonography）